Clinical trial exclusion criterion:
myocardial infarction

Annotated entities:
- Condition: "myocardial infarction"